Sonographic diagnosis of ovarian endometrioma with diameter at least 4cm on 2 separate scans at least 6 weeks apart

The above is a clinical trial inclusion criterion. Annotated with entity spans:
[Procedure: Sonographic] diagnosis of [Condition: ovarian endometrioma] with [Qualifier: diameter at least 4cm] on [Multiplier: 2 separate scans] [Temporal: at least 6 weeks apart]